Clinical trial inclusion criterion:
Healthy men and women, age 40-75 yrs, without any disease and need of medication.

Annotated entities:
- Person: "men"
- Person: "women"
- Person: "age"
- Value: "40-75 yr"
- Qualifier: "Healthy"
- Negation: "without"
- Condition: "disease"
- Qualifier: "any"
- Procedure: "medication"